How are super enhancers defined?

Super-enhancers (SEs) are large clusters of transcriptional enhancers that drive expression of genes controlling cell identity. They recruit much of the cell's transcriptional apparatus and are defined by extensive acetylation of histone H3 lysine 27 (H3K27ac).